Clinical trial exclusion criterion:
1. Clinically significant microvascular complications: nephropathy (estimated glomerular filtration rate below 40 ml/min), neuropathy (especially diagnosed gastroparesis) or severe proliferative retinopathy as judged by the investigator.

Entity relations:
- Has_value("estimated glomerular filtration rate", "below 40 ml/min")
- Subsumes("nephropathy", "estimated glomerular filtration rate")
- Subsumes("neuropathy", "gastroparesis")
- Has_qualifier("microvascular complications", "as judged by the investigator")
- Subsumes("microvascular complications", "nephropathy")
- OR("nephropathy", "neuropathy", "severe proliferative retinopathy")